下列何者為導管相關細菌感染的最主要來源？
A. 病人皮膚上的菌叢和醫護人員操作時的污染
B. 原裝導管污染
C. 原裝輸液污染
D. 經由其他感染部位血流移行

正確答案：A. 病人皮膚上的菌叢和醫護人員操作時的污染